Not diabetic

The above is a clinical trial inclusion criterion. Annotated with entity spans:
[Negation: Not] [Condition: diabetic]